下列那一項檢查，最不適用於急性胰臟炎之病患？
A. 超音波掃描（sonography）
B. 電腦斷層攝影（CT scan）
C. 內視鏡逆行性膽道胰管攝影（ERCP）
D. 血管攝影（angiography）

正確答案：C. 內視鏡逆行性膽道胰管攝影（ERCP）